Clinical trial exclusion criterion:
Major typhoid fever-associated complications

Annotated entities:
- Qualifier: "typhoid fever-associated"
- Condition: "typhoid fever"
- Condition: "complications"
- Qualifier: "Major"
- Subjective_judgement: "Major"